Si el perceptil 95 de la talla de los recién nacidos de una determinada población es 45 cm, el:
1. 95% de los recién nacidos mide más de 45 cm.
2. 5% de los recién nacidos mide más de 45 cm.
3. 95% de los recién nacidos mide 45 cm.
4. 5% de los recién nacidos mide menos de 45 cm.

Respuesta correcta: 2. 5% de los recién nacidos mide más de 45 cm.